登山者進入高海拔地區時，動脈氧分壓降為80 mmHg時，最主要是發生下列何種反應所造成？
A. 呼吸性酸血症（respiratory acidosis）
B. 紅血球減少製造 2,3-二磷	油酯（2,3-diphosphoglycerate），以便增加血紅素對氧氣親和力
C. 主動脈體（aortic body）因缺氧而抑制神經衝動
D. 每分	通氣量（ventilation）增加

正確答案：D. 每分	通氣量（ventilation）增加